Clinical trial exclusion criterion:
Gastroesophageal Reflux Disease (GERD; active requiring significant intervention not including OTC medication)

Annotated entities:
- Condition: "Gastroesophageal Reflux Disease"
- Condition: "GERD"
- Procedure: "significant intervention"
- Drug: "OTC medication"
- Negation: "not"